因腦中風造成閉鎖症候群（locked-in syndrome），下列何者為最常見的原因？
A. 內頸動脈阻塞（internal carotid artery occlusion）
B. 基底動脈阻塞（basilar artery occlusion）
C. 小血管梗塞（small-vessel infarction）
D. 心房顫動造成心因性血栓（cardiac emboli）

正確答案：B. 基底動脈阻塞（basilar artery occlusion）